Clinical trial inclusion criterion:
Patients must be at least 21 years old.

Annotated entities:
- Person: "old"
- Value: "at least 21 years"